La enzima reguladora clave de la ruta de las pentosas fosfato está regulada de forma positiva por:
1. NADH.
2. ADP.
3. GTP.
4. NADP+.
5. FADH.

Respuesta correcta: 4. NADP+.